關於顱外頸動脈剝離（carotid dissection），下列何者錯誤？
A. 最容易發生在顱外內頸動脈之頸部（cervical part），而非頸動脈分支處（carotid bifurcation）
B. 可以外科方法做內膜切除術（carotid endartectomy）治療
C. 磁振造影檢查（MRI）可看到動脈壁上的血腫訊號
D. 藥物治療無效者可考慮支架置放術（carotid stenting）治療

正確答案：B. 可以外科方法做內膜切除術（carotid endartectomy）治療